關於兒童腸	疊（Intussusception）的表現，下列何者最為典型？
A. 通常在1至2歲腸	疊的病童，大都可問到在發病前有受到病毒感染，以致於淋巴增生產生引導點（Leading point）
B. 病童多為急性持續性腹痛，中間不停歇，膝蓋彎曲朝向腹部，臉色蒼白表情痛苦
C. 除了腹痛嘔吐和草莓醬樣大便（Currant jelly stool）之外，在病童右上腹可能會摸到硬塊，且在腹痛病程之間可能會有嗜睡的現象
D. 以顯影劑或生理食鹽水或空氣從肛門端導入大腸回灌將腸	疊灌通後，復發的機率為20%以上

正確答案：C. 除了腹痛嘔吐和草莓醬樣大便（Currant jelly stool）之外，在病童右上腹可能會摸到硬塊，且在腹痛病程之間可能會有嗜睡的現象